Central nervous system (CNS) metastases or prior radiation for CNS metastases

The above is a clinical trial exclusion criterion. Annotated with entity spans:
[Condition: Central nervous system (CNS) metastases] or prior [Procedure: radiation] for [Condition: CNS metastases]